What is the reason for the abundance of operons in the genome of C. elegans?

Our data shows that transcription proceeds in some ways as if operons were composed of multiple adjacent single genes. Previous work has proposed that germline expression drives operon organization in Caenorhabditis elegans, and a recent hypothesis proposes that operons provide an evolutionary advantage via the conservation of transcriptional machinery during recovery from growth arrested states.